下列何者不是治療氣喘的藥物？
A. cromolyn
B. propranolol
C. zileuton
D. beclomethasone

正確答案：B. propranolol